Clinical trial exclusion criterion:
Patients with sensitivity to botulinum toxin or human albumin

Entity relations:
- AND("sensitivity", "botulinum toxin")
- OR("botulinum toxin", "human albumin")